Which computational methods are used for the definition of synteny?

Computational methods used for the definition of synteny include multisyn, poff, orthocluster, phyldiag, synblast, cinteny, domainmanagement, domainScanx, run orthoclustereddb, view synteny and others.